Clinical trial exclusion criterion:
Pathological fetal heart rate pattern (cardiotocogram, CTG) before Syntocinon® initiation

Annotated entities:
- Condition: "Pathological fetal heart rate pattern"
- Procedure: "cardiotocogram"
- Procedure: "CTG"
- Temporal: "before Syntocinon® initiation"
- Drug: "Syntocinon®"
- Reference_point: "Syntocinon® initiation"